Refusal for organ procurement by the donor (confirmed by the French national register or reported by the next-of-kin).

The above is a clinical trial exclusion criterion. Annotated with entity spans:
[Observation: Refusal] for [Procedure: organ procurement] by the donor (confirmed by the [Qualifier: French national register] or [Qualifier: reported by the next-of-kin]).